preoperative use of opioid drugs (excl. codeine, tramadol)

The above is a clinical trial exclusion criterion. Annotated with entity spans:
[Temporal: preoperative] use of [Drug: opioid drugs] ([Negation: excl.] [Drug: codeine], [Drug: tramadol])